25 歲女性，G3P2，姙娠 32 週，急診剖腹生產發現「柯氏子宮」（Couvelaire uterus），請問最可能的診斷為：
A. 胎盤早期剝離
B. 前置胎盤
C. 子宮破裂
D. 植入性胎盤

正確答案：A. 胎盤早期剝離